Spinal pain as measured by BASDAI question #2 = 4 cm (0-10 cm) at baseline

The above is a clinical trial inclusion criterion. Annotated with entity spans:
[Condition: Spinal pain] as measured by [Measurement: BASDAI question #2] [Value: = 4 cm] (0-10 cm) [Temporal: at baseline]